Clinical trial exclusion criterion:
PMH of diagnosed heart, kidney, peripheral vascular, or cerebral vascular disease, or diabetes mellitus;

Annotated entities:
- Condition: "diabetes mellitus"
- Condition: "cerebral vascular disease"
- Condition: "peripheral vascular, disease"
- Condition: "kidney disease"
- Condition: "heart disease"